Clinical trial exclusion criterion:
13. Body mass index ≥35.0 at Screening.

Annotated entities:
- Parsing_Error: "13."
- Measurement: "Body mass index"
- Value: "≥35.0"
- Temporal: "at Screening"
- Reference_point: "Screening"